Clinical trial inclusion criterion:
Children 6 month to 14 years who will be presented to the pediatric emergency or attended by emergency medical service who have active seizure and had no intravenous access would be eligible for the study.

Annotated entities:
- Person: "Children"
- Value: "6 month to 14 years"
- Person: "years"
- Visit: "pediatric emergency"
- Observation: "attended by emergency medical service"
- Qualifier: "active"
- Condition: "seizure"
- Negation: "no"
- Device: "intravenous access"